Clinical trial inclusion criterion:
Age 60-80 years

Entity relations:
- Has_value("Age", "60-80 years")